下列何種細胞不是抗原呈獻細胞（antigen-presenting cell, APC）？
A. B細胞
B. CD4+ T細胞
C. 巨噬細胞（macrophage）
D. 蘭格翰細胞（Langerhans' cells）

正確答案：B. CD4+ T細胞